Clinical trial exclusion criterion:
10. Subject needs mechanical ventilation;

Annotated entities:
- Procedure: "mechanical ventilation"